對於 Tumor markers 的敘述，下列何者最不合理？
A. Carbohydrate antigen 19-9（CA19-9）通常用來當胰臟癌的 tumor marker
B. Carcinoembryonic antigen（CEA）臨床上常用來監測大腸直腸癌
C. α-fetoprotein 在胎兒時會下降，出生後會逐漸上升，懷孕時會下降
D. CA-125 在子宮內膜異位和肝硬化的病患會上升

正確答案：C. α-fetoprotein 在胎兒時會下降，出生後會逐漸上升，懷孕時會下降